What memory problems are reported in the " Gulf war syndrome"

memory loss